Age younger than 18 yrs. or older than 75 yrs.

The above is a clinical trial exclusion criterion. Annotated with entity spans:
[Person: Age] [Value: younger than 18 yrs. or older than 75 yrs.]